一位30歲無精蟲的病人，兩側睪丸長徑約1 cm，血清中FSH、LH及testosterone都低於正常值，則最適當的檢查或治療為何？
A. 卵細胞質內精蟲注射（ICSI）
B. 先做睪丸切片看有無精蟲
C. HCG + recombinant FSH注射治療
D. testosterone補充療法

正確答案：C. HCG + recombinant FSH注射治療